Clinical trial inclusion criterion:
Patients aged of 18 and over,

Annotated entities:
- Person: "aged"
- Value: "18 and over"